Clinical trial inclusion criterion:
HAND diagnosis (ANI, MND, or HAD) within 60 days prior to study entry. HAND is defined as at least mild impairment on neurocognitive testing (more than one standard deviation below appropriate normative data in two domains of functioning) and no severely confounding factors.

Annotated entities:
- Condition: "HAND"
- Condition: "ANI"
- Condition: "MND"
- Condition: "HAD"
- Temporal: "within 60 days prior to study entry"
- Value: "more than one standard deviation below appropriate normative data"
- Measurement: "neurocognitive testing"
- Multiplier: "in two domains of functioning"
- Qualifier: "at least mild"
- Value: "impairment"
- Condition: "severely confounding factors"
- Negation: "no"